42 歲男性因雙側肺氣腫（emphysema）導致呼吸窘迫而入院，胸部電腦斷層顯示其右上肺葉有一巨大之氣泡（bullae），且壓迫到縱膈腔而出現 mediastinal deviation 的現象。若欲為此病患實行 lung volume reduction surgery，為避免病患術後發生呼吸衰竭，下列檢查何者無助益？
A. 動脈血氧（ABG）
B. 肺部之 ventilation and perfusion scan
C. 肺功能檢查
D. 心電圖檢查

正確答案：D. 心電圖檢查